De las principales complicaciones y lesiones que se producen en la posición de litotomía, señale la respuesta INCORRECTA:
1. Acortamiento del nervio ciático.
2. Compresión del nervio safeno.
3. Lesión en el nervio obturador.
4. Hipotensión postural.

Respuesta correcta: 1. Acortamiento del nervio ciático.